大腸扭結（volvulus）發生的部位，以那一處為最少見？
A. 乙狀結腸
B. 右側大腸及迴腸末段
C. 盲腸
D. 橫結腸

正確答案：D. 橫結腸